Clinical trial inclusion criterion:
Diagnostic and Statistical Manual of Mental Disorders, 4th Edition (DSM IV) test positive for dementia

Annotated entities:
- Measurement: "Diagnostic and Statistical Manual of Mental Disorders, 4th Edition (DSM IV) test"
- Value: "positive"